Healthy adults 30- 65 years old,

The above is a clinical trial inclusion criterion. Annotated with entity spans:
[Condition: Healthy] [Person: adults] [Value: 30- 65 years old],